List bacterial species identified in the iceman tissues.

Spirochete Treponema denticola
Clostridium perfringens
Clostridium ghonii
Clostridium sordellii
Eubacterium tenue
Bacteroides sp
Vibrio
Sphingomonas
Afipia
Curtobacterium
Microbacterium
Agromyces